下列何者可用於治療急性與慢性無機砷中毒（inorganic arsenic poisoning）的螫合劑（chelating agent）？
A. unithiol
B. penicillamine
C. deferoxamine
D. prussian blue

正確答案：A. unithiol